臨床上合併低血鉀（hypokalemia）及高血壓之內分泌腫瘤，常見好發於何處？
A. 腎上腺髓質（adrenal medulla）
B. 腎上腺皮質球狀帶（zona glomerulosa）
C. 腎上腺皮質束狀帶（zona fasciculata）
D. 腎上腺皮質網狀帶（zona reticularis）

正確答案：B. 腎上腺皮質球狀帶（zona glomerulosa）